Known IgE( Immunoglobulin E)-mediated hypersensitivity to eggs manifested as hives, swelling of the mouth and throat, difficulty in breathing, hypotension, or shock

The above is a clinical trial exclusion criterion. Annotated with entity spans:
Known [Condition: IgE( Immunoglobulin E)-mediated hypersensitivity] to [Drug: eggs] manifested as [Condition: hives], [Condition: swelling of the mouth and throat], [Condition: difficulty in breathing], [Condition: hypotension], or [Condition: shock]